Clinical trial exclusion criterion:
1. Need for combined organ transplantation with an extra-renal organ and/or islet cell transplant.

Annotated entities:
- Procedure: "combined organ transplantation"
- Qualifier: "extra-renal organ"
- Procedure: "islet cell transplant"